Forman parte de las uniones herméticas o estrechas:
1. Desmogleínas.
2. Desmocolinas.
3. Claudinas.
4. Integrinas.

Respuesta correcta: 3. Claudinas.